What is the tradename of apixaban?

The tradename of apixaban is Eliquis.